hematology diseases

The above is a clinical trial exclusion criterion. Annotated with entity spans:
[Condition: hematology diseases]